Which models are used for predicting disease progression in Duchenne Muscular Dystrophy?

Longitudinal changes in biomarkers were modeled with a cumulative distribution function using a nonlinear mixed-effects approach.